Clinical trial inclusion criterion:
Alkaline phosphatase less than or equal to 5 x ULN

Entity relations:
- Has_value("Alkaline phosphatase", "less than or equal to 5 x ULN")